What is the link between Nonidet-40 (NP-40) and biotinylation?

NP-40 reduces contamination by endogenous biotinylated carboxylases during purification of biotin tagged nuclear proteins.